Cephalic presentation

The above is a clinical trial inclusion criterion. Annotated with entity spans:
[Observation: Cephalic presentation]